People with missing hand(s) and/or leg(s)

The above is a clinical trial exclusion criterion. Annotated with entity spans:
People with [Condition: missing hand](s) and/or leg(s)